Subject has not been treated with any investigational drug or device within 30 days of the screening visit.

The above is a clinical trial inclusion criterion. Annotated with entity spans:
[Non-query-able: Subject has not been treated with any investigational drug or device within 30 days of the screening visit.]